Clinical trial exclusion criterion:
Other severe coexisting morbidity which, in the investigator's opinion, can prevent the patient from participating in the study.

Annotated entities:
- Temporal: "coexisting"
- Condition: "morbidity"
- Non-query-able: "in the investigator's opinion, can prevent the patient from participating in the study"